Clinical trial exclusion criterion:
Has a history of (non-infectious) pneumonitis that required steroids or current pneumonitis.

Annotated entities:
- Drug: "steroids"
- Condition: "pneumonitis"
- Temporal: "current"
- Condition: "pneumonitis"
- Temporal: "history"
- Qualifier: "required steroids"